planned decompression surgery with autologous stem cell transplant

The above is a clinical trial inclusion criterion. Annotated with entity spans:
[Mood: planned] [Procedure: decompression surgery] with [Procedure: autologous stem cell transplant]